History of tubal ligation or hysterectomy

The above is a clinical trial exclusion criterion. Annotated with entity spans:
History of [Procedure: tubal ligation] or [Procedure: hysterectomy]